10. Serum creatinine ≤1.5 × ULN and glomerular filtration rate (GFR) > 30 mL/min

The above is a clinical trial inclusion criterion. Annotated with entity spans:
10. [Measurement: Serum creatinine] [Value: ≤1.5 × ULN] and [Measurement: glomerular filtration rate (GFR)] [Value: > 30 mL/min]